What is the nucleotide composition of the Lamin Associated Domains (LADs)?

Instead, cLADs are universally characterized by long stretches of DNA of high A/T content. This suggests that the A/T rule represents a default positioning mechanism that is locally overruled during lineage commitment.